Clinical trial exclusion criterion:
Recipient or donor is known to be seropositive for human immunodeficiency virus (HIV)

Entity relations:
- Has_value("human immunodeficiency virus", "seropositive")
- Subsumes("human immunodeficiency virus", "HIV")
- AND("Recipient", "human immunodeficiency virus")
- OR("Recipient", "donor")